How does condensin affect the function of topoisomeraseII?

aids sister chromatid decatenation by topoisomerase II